Los enlaces y grupos funcionales que dan lugar a la absorción de radiación visible-ultravioleta se denominan:
1. Fotocromos.
2. Policromos.
3. Auxocromos.
4. Cromóforos.

Respuesta correcta: 4. Cromóforos.